Clinical trial inclusion criterion:
Mini-Mental State Exam = 24.

Entity relations:
- Has_value("Mini-Mental State Exam", "= 24")